Clinical trial exclusion criterion:
Systolic pulmonary artery pressure (SPAP) >40 mmHg (and/or tricuspid regurgitation [TR] jet velocity >2.9 m/s) In cases where an actual SPAP value is not measurable due to lack of adequate TR jet, the pulmonary flow acceleration time measured at the right ventricular outflow tract (RVOTAT) will be used to assess eligibility. Participants with a RVOTAT =100 milliseconds (msec) will be excluded, suggesting an elevated mean SPAP; eligibility for the those participants with RVOTAT between 100 and 120 msec will be determined based on combined assessment of the TR jet, septal motion, and right ventricular size.

Entity relations:
- Has_value("Systolic pulmonary artery pressure (SPAP)", ">40 mmHg")
- Has_value("tricuspid regurgitation [TR] jet velocity", ">2.9 m/s")
- Has_value("RVOTAT", "=100 milliseconds (msec)")
- OR("Systolic pulmonary artery pressure (SPAP)", "tricuspid regurgitation [TR] jet velocity", "RVOTAT")